Which class of disorders are caused by AMPA receptor GluA2 subunit defects?

AMPA receptor GluA2 subunit defects are a cause of neurodevelopmental disorders. Mutations lead to a decrease in agonist-evoked current mediated by mutant subunits.